Según las últimas ediciones del DSM, para realizar un diagnóstico de “trastorno psicótico breve”:
1. Se requiere la presencia tanto ideas delirantes como de alucinaciones.
2. Se requiere la presencia de ideas delirantes, pero no de alucinaciones.
3. Se requiere que el trastorno se explique cómo efecto secundario de un trastorno depresivo mayor o bipolar.
4. La duración del episodio deber ser más de un mes y menos de seis.
5. La duración del episodio es de al menos un día, pero menos de un mes.

Respuesta correcta: 5. La duración del episodio es de al menos un día, pero menos de un mes.